¿Cuál de las siguientes terapias utiliza los procedimientos más y mejor evaluados en el tratamiento de los trastornos del espectro autista?:
1. Terapia Ocupacional.
2. Terapia de integración auditiva.
3. Terapias basadas en el análisis aplicado de la conducta.
4. Hipnoterapia.

Respuesta correcta: 3. Terapias basadas en el análisis aplicado de la conducta.